Clinical trial exclusion criteria:
Re-transplant;
Patients with any panel reactive antibody (PRA) equal to or above 50%, class I or class II;
Acute rejection episode in the last 30 days, or episode > 2A in the Banff criteria;
GFR (MDRD) < 40 ml/min;
Proteinuria > 0,5 g/l;
Hemoglobin < 10 g/l and/or leucocytes < 4000 cels/mm3 and/or platelets < 150.000 cels/mm3;
Triglycerides > 500 mg/dl with or without use of fibrate;
Cholesterol total > 300 mg/dl with or without use of statin;
Hepatic abnormalities;
Significant periphery edema;
Pulmonary abnormalities or breast x-ray abnormalities;
Hyper sensibility to sirolimus formula;

Annotated entities:
- Procedure: "Re-transplant"
- Measurement: "panel reactive antibody"
- Measurement: "PRA"
- Value: "equal to or above 50%"
- Value: "class I"
- Value: "class II"
- Condition: "Acute rejection episode"
- Temporal: "last 30 days"
- Measurement: "Banff criteria"
- Value: "> 2A"
- Measurement: "GFR"
- Value: "< 40 ml/min"
- Condition: "Proteinuria"
- Multiplier: "> 0,5 g/l"
- Measurement: "Hemoglobin"
- Value: "< 10 g/l"
- Measurement: "leucocytes"
- Value: "< 4000 cels/mm3"
- Measurement: "platelets"
- Value: "< 150.000 cels/mm3"
- Measurement: "Triglycerides"
- Value: "> 500 mg/dl"
- Drug: "fibrate"
- Measurement: "Cholesterol total"
- Value: "> 300 mg/dl"
- Drug: "statin"
- Condition: "Hepatic abnormalities"
- Condition: "periphery edema"
- Qualifier: "Significant"
- Condition: "Pulmonary abnormalities"
- Procedure: "breast x-ray"
- Value: "abnormalities"
- Condition: "Hyper sensibility"
- Drug: "sirolimus"